3. Cardiac pacemakers, neural stimulators, implantable defibrillator, implanted medication pumps, intracardiac lines, or acute, unstable cardiac disease, with intracranial implants (e.g. aneurysm clips, shunts, stimulators, cochlear implants, or electrodes) or any other metal object within or near the head that precludes MRI scanning.

The above is a clinical trial exclusion criterion. Annotated with entity spans:
[Parsing_Error: 3.] [Device: Cardiac pacemakers], [Device: neural stimulators], [Device: implantable defibrillator], [Device: implanted medication pumps], [Device: intracardiac lines], or [Qualifier: acute], [Qualifier: unstable] [Condition: cardiac disease], with [Device: intracranial implants] (e.g. [Device: aneurysm clips], [Device: shunts], [Device: stimulators], [Device: cochlear implants], or [Device: electrodes]) or any other [Device: metal object within or near the head] that [Qualifier: precludes MRI scanning].